What chromosome is affected in Turner's syndrome?

turner's syndrome (ts) is a chromosomal defect with partial or total absence of the x chromosome.